What is the effect of epiregulin on leptin secretion?

Epiregulin induces leptin secretion.